Clinical trial inclusion criterion:
ECOG performance status 0-2,Child pugh A or B

Annotated entities:
- Measurement: "ECOG performance status"
- Value: "0-2"
- Measurement: "Child pugh"
- Value: "A"
- Value: "B"